Clinical trial exclusion criterion:
Serum albumin level less than 2 g / dL

Annotated entities:
- Measurement: "Serum albumin level"
- Value: "ess than 2 g / dL"